La triada clásica de síntomas asociados al síndrome hemolítico urémico consiste en:
1. Anemia ferropénica, trombocitopenia y daño renal agudo.
2. Anemia hemolítica, pancitopenia y daño renal crónico.
3. Anemia hemolítica, trombocitopenia y daño renal agudo.
4. Anemia hemolítica, pancitopenia y daño renal agudo.

Respuesta correcta: 3. Anemia hemolítica, trombocitopenia y daño renal agudo.